30歲男病人主訴左手第2、3指及右手3、4指的遠端指骨關節（distal interphalangeal joint）紅腫熱痛已3星期。同時兩側下肢的皮膚也出現了許多突出會脫屑的紅疹塊。最可能的診斷為何？
A. 類風濕性關節炎
B. 細菌性關節炎
C. 全身性紅斑性狼瘡
D. 乾癬性關節炎

正確答案：D. 乾癬性關節炎